Clinical trial inclusion criterion:
19 years old and above.

Annotated entities:
- Person: "old"
- Value: "19 years and above"